Exclusions Related to Cardiovascular Disease

The above is a clinical trial exclusion criterion. Annotated with entity spans:
[Parsing_Error: Exclusions Related to Cardiovascular Disease]